ECOG performance status of 2 or lower

The above is a clinical trial inclusion criterion. Annotated with entity spans:
[Measurement: ECOG performance status] of [Value: 2 or lower]